Clinical trial inclusion criteria:
histologically proven prostate adenocarcinoma within 1 year of enrollment
Low risk: Gleason <or=6 & PSA <or=10 & Clinical Stage T1b-T2a,Nx or N0, Mx or M0
Intermediate risk:Gleason <or=6 & PSA<or=10 & Clinical Stage T2b OR Gleason=7 & PSA<or=10 & Clinical Stage T1b-T2b OR Gleason <or=6 & PSA > 10 & < or =20 & Clinical Stage T1b- T2b, Nx or NO, Mx or M0
ECOG Performance Status 0-1
No prior prostate radiation or other definitive therapy

Annotated entities:
- Condition: "prostate adenocarcinoma"
- Qualifier: "histologically proven"
- Temporal: "within 1 year of enrollment"
- Reference_point: "enrollment"
- Measurement: "Gleason"
- Observation: "Low risk"
- Value: "<or=6"
- Measurement: "PSA"
- Value: "<or=10"
- Measurement: "Clinical Stage"
- Value: "T1b-T2a"
- Value: "Mx"
- Value: "M0"
- Value: "Nx"
- Value: "N0"
- Observation: "Intermediate risk"
- Measurement: "Gleason"
- Value: "<or=6"
- Measurement: "PSA"
- Value: "<or=10"
- Measurement: "Clinical Stage"
- Value: "T2b"
- Measurement: "Gleason"
- Value: "=7"
- Measurement: "PSA"
- Value: "<or=10"
- Measurement: "Clinical Stage"
- Value: "T1b-T2b"
- Measurement: "Gleason"
- Value: "<or=6"
- Measurement: "PSA"
- Value: "> 10 & < or =20"
- Measurement: "Clinical Stage"
- Value: "T1b- T2b"
- Value: "Nx"
- Value: "NO"
- Value: "Mx"
- Value: "M0"
- Measurement: "ECOG Performance Status"
- Value: "0-1"
- Procedure: "prostate radiation"
- Negation: "No"
- Procedure: "definitive therapy"